Clinical trial exclusion criterion:
History of decompensated cirrhosis (defined as jaundice in the presence of cirrhosis, ascites, bleeding gastric or esophageal varices or encephalopathy)

Annotated entities:
- Condition: "cirrhosis"
- Qualifier: "decompensated"
- Condition: "jaundice"
- Condition: "cirrhosis"
- Condition: "ascites"
- Condition: "bleeding gastric"
- Condition: "esophageal varices"
- Condition: "encephalopathy"